Clinical trial exclusion criterion:
symptomatic atherosclerosis of the carotid artery;

Entity relations:
- Has_qualifier("atherosclerosis", "of the carotid artery")
- Has_qualifier("atherosclerosis", "symptomatic")